下列何者無法經由受質階層磷酸化（substrate-level phosphorylation）直接合成ATP（或GTP）？
A. 2-phosphoglycerate
B. phosphoenolpyruvate
C. succinyl-CoA
D. 1, 3-bisphosphoglycerate

正確答案：A. 2-phosphoglycerate